En la reacción de metoxibenceno con anhídrido acético y tricloruro de aluminio seguido de tratamiento con una disolución acuosa de ácido clorhídrico se forma mayoritariamente:
1. Acido 4-metoxibenzoico.
2. 1-(4-metoxifenil)etanona.
3. 1-(3-metoxifenil)etanona.
4. Acido 3-metoxibenzocio.
5. Acetato de 4-metoxifenilo.

Respuesta correcta: 2. 1-(4-metoxifenil)etanona.